一位3 歲的男童於一週前發燒、腹瀉，曾在診所接受藥物治療。本日求診時身體診查發現男童有脫水、四肢水腫、肝脾腫大、身上有紫斑，而且男童顯得煩躁不安。實驗室檢查發現血中白血球數為 22,000/mm3 8 g/dL；血小板數為55,000/mm3，同時在血液抹片中可以見到毛刺細胞（burr cells）及破碎的紅血球（fragmented RBC），下列何者為最有可能之診斷？
A. 急性淋巴性白血病（acute lymphoblastic leukemia）
B. 葡萄糖-6-磷酸脫氫酶缺乏症（G6PD deficiency）合併急性溶血
C. 傳染性單核球增生症（infectious mononucleosis）
D. 溶血性尿毒症候群（hemolytic-uremic syndrome）

正確答案：D. 溶血性尿毒症候群（hemolytic-uremic syndrome）